Clinical trial exclusion criterion:
Significant motor complication affecting daily activities

Entity relations:
- Has_qualifier("motor complication", "Significant")